History of hypersensitivity to any of the study drugs or its excipients or to drugs of similar chemical classes.

The above is a clinical trial inclusion criterion. Annotated with entity spans:
History of [Condition: hypersensitivity] to any of the [Drug: study drugs] or its [Drug: excipients] or to [Drug: drugs of similar chemical classes].